Clinical trial exclusion criterion:
Inability to use PCA

Entity relations:
- AND("Inability to use", "PCA")